Clinical trial exclusion criterion:
Atrial fibrillation of new onset or when rate control has been difficult

Annotated entities:
- Condition: "Atrial fibrillation"
- Temporal: "new onset"
- Condition: "rate control has been difficult"